Women of child-bearing potential, who are biologically able to conceive, not employing two forms of highly effective contraception or who are pregnant.

The above is a clinical trial exclusion criterion. Annotated with entity spans:
[Person: Women] of [Condition: child-bearing potential], who are [Condition: biologically able to conceive], [Negation: not] employing [Multiplier: two] forms of [Device: highly effective contraception] or who are [Condition: pregnant].